Please list the 2 vaccines for herpes zoster(shingles)

The are 2 vaccines for herpes zoster, adjuvated recombinant vaccines and a live attenuated vaccine.